Clinical trial exclusion criterion:
Contraindications of tranexamic acid, floseal, or rivaroxaban

Entity relations:
- AND("Contraindications", "tranexamic acid")
- OR("tranexamic acid", "rivaroxaban", "floseal")